下列何者不是腎臟癌之腫瘤伴隨症候群（paraneoplastic syndromes）？
A. 紅血球增多症（erythrocytosis）
B. 低血鈣症（hypocalcemia）
C. 高血壓
D. 非轉移性肝功能異常（Stauffer's syndrome）

正確答案：B. 低血鈣症（hypocalcemia）